Clinical trial exclusion criterion:
Risk of severe alcohol withdrawal (e.g. history of seizures or delirium tremens)

Entity relations:
- Has_qualifier("alcohol withdrawal", "severe")
- Has_mood("alcohol withdrawal", "Risk of")
- Has_temporal("seizures", "history")
- OR("seizures", "delirium tremens")